Clinical trial inclusion criterion:
Patients with signed informed consent

Annotated entities:
- Non-query-able: "Patients with signed informed consent"